Clinical trial exclusion criterion:
any current (or within past 2 months) medical condition requiring medication that would interact with dronabinol or interfere with the study protocol

Annotated entities:
- Temporal: "current"
- Temporal: "within past 2 months"
- Condition: "medical condition"
- Drug: "medication"
- Mood: "would interact with"
- Drug: "dronabinol"
- Mood: "interfere with the study protocol"